En el tratamiento del asma se puede utilizar a demanda:
1. Glucocorticoides inhalados a dosis bajas.
2. Agonista beta-2 adrenérgico inhalado de acción larga.
3. Agonista beta-2 adrenérgico inhalado de acción corta.
4. Anticolinérgicos inhalados.
5. Cromoglicato disódico inhalado.

Respuesta correcta: 3. Agonista beta-2 adrenérgico inhalado de acción corta.